Clinical trial exclusion criterion:
we will not include thumbs

Annotated entities:
- Non-representable: "we will not include thumbs"